Class III congestive heart failure

The above is a clinical trial exclusion criterion. Annotated with entity spans:
[Qualifier: Class III] [Condition: congestive heart failure]